在白血球生成過程中，特異性顆粒（specific granule）最早出現於下列何者？
A. 髓細胞（myelocytes）
B. 成髓細胞（myeloblasts）
C. 前髓細胞（promyelocytes）
D. 後髓細胞（metamyelocytes）

正確答案：A. 髓細胞（myelocytes）